Clinical trial exclusion criterion:
Brain tumor and other neoplastic disorders outside the brain where disease itself or its treatment (radiation, chemotherapy) is likely to affect brain structure or function.

Annotated entities:
- Condition: "Brain tumor"
- Condition: "neoplastic disorders"
- Qualifier: "outside the brain"
- Qualifier: "likely to affect brain structure"
- Qualifier: "likely to affect brain function"
- Procedure: "radiation"
- Procedure: "chemotherapy"